Clinical trial exclusion criterion:
1. Decrease in size of the designated target ulcer(s) by ≥ 30% during the 7-day screening period

Annotated entities:
- Parsing_Error: "1."
- Condition: "target ulcer"
- Qualifier: "Decrease in size"
- Value: "≥ 30%"
- Temporal: "during the 7-day screening period"